Clinical trial exclusion criterion:
Inability to speak English

Annotated entities:
- Non-query-able: "Inability to speak English"